引起低鎂血症（Hypomagnesemia）的原因不包括下列何因素？
A. 慢性腹瀉
B. 腎衰竭
C. 嚴重酗酒
D. 糖尿病併持續多尿

正確答案：B. 腎衰竭